Clinical trial inclusion criterion:
having given written consent to participation in the study

Annotated entities:
- Informed_consent: "having given written consent to participation in the study"